Clinical trial inclusion criteria:
choroidal neovascularization caused by age-related macula degeneration
no previous treatment
a follow-up at least 12 months
a baseline visual acuity ranging from a letter score of 0 to 70 on the Early Treatment Diabetic Retinopathy Study chart

Annotated entities:
- Condition: "choroidal neovascularization"
- Qualifier: "age-related"
- Condition: "macula degeneration"
- Negation: "no"
- Temporal: "previous"
- Procedure: "treatment"
- Context_Error: "no previous treatment"
- Observation: "follow-up"
- Temporal: "at least 12 months"
- Measurement: "visual acuity"
- Temporal: "baseline"
- Value: "letter score of 0 to 70"
- Procedure: "Early Treatment Diabetic Retinopathy Study chart"